關於氣胸（pneumothorax）的敘述，下列何者正確？
A. 原發性自發性氣胸（primary spontaneous pneumothorax）的病人，發生一次氣胸後，約有50%會復發
B. 一位使用呼吸器的病人，突然發生張力性氣胸（tension pneumothorax）時，醫師無法靠身體診查診斷出來
C. 病人有肋膜積水（pleural effusion），經細針導管引流後，出現氣胸（pneumothorax），一定是針頭導致臟層肋膜（visceral pleura）破洞
D. 慢性阻塞性肺病（chronic obstructive pulmonary disease）的病人發生氣胸，只要給與氧氣治療及觀察即可

正確答案：A. 原發性自發性氣胸（primary spontaneous pneumothorax）的病人，發生一次氣胸後，約有50%會復發